下列有關鼠蹊部疝氣之敘述，何者正確？
A. 需手術治療才能痊癒
B. 不手術也不會發生併發症
C. 疝氣帶治療即可
D. 一定要補人工網膜（mesh）

正確答案：A. 需手術治療才能痊癒